Hypersensitivity to spironolactone, chlorthalidone, amlodipine, human recombinant insulin or Definity

The above is a clinical trial exclusion criterion. Annotated with entity spans:
[Condition: Hypersensitivity] to [Drug: spironolactone], [Drug: chlorthalidone], [Drug: amlodipine], [Drug: human recombinant insulin] or Definity